Clinical trial inclusion criterion:
Has had a self-reported visual exam in the last two years

Annotated entities:
- Procedure: "self-reported visual exam"
- Temporal: "in the last two years"